Los centros de color o centros F se producen:
1. Exclusivamente en cristales que contienen flúor.
2. Por calentamiento de un cristal en el vapor de un metal alcalino.
3. Por enfriamiento de un cristal en el vapor de un metal alcalino.
4. Por calentamiento de un cristal en presencia de flúor.
5. Por enfriamiento de un cristal en presencia de flúor.

Respuesta correcta: 2. Por calentamiento de un cristal en el vapor de un metal alcalino.